Clinical trial exclusion criterion:
Leg ulcers of greater than 1 year duration

Entity relations:
- Has_temporal("Leg ulcers", "greater than 1 year duration")